一餵食母奶的足月新生兒，於 7 天大時回診，因黃疸，檢查血清膽紅素為 13 mg/dL，其出生體重 3,200 公克，現在為 3,250 公克，活力佳。下列那一項處理最適當？
A. 照光治療
B. 停餵母奶
C. 繼續觀察
D. 住院檢查

正確答案：C. 繼續觀察